long-term oxygen therapy

The above is a clinical trial exclusion criterion. Annotated with entity spans:
[Procedure: long-term oxygen therapy]